Clinical trial exclusion criterion:
BMI greater than 35 or less than 20

Entity relations:
- Has_value("BMI", "greater than 35")
- OR("greater than 35", "less than 20")